Clinical trial exclusion criterion:
cognitive difficulties

Annotated entities:
- Condition: "cognitive difficulties"